4. A woman who is pregnant, nursing an infant, or planning a pregnancy.

The above is a clinical trial exclusion criterion. Annotated with entity spans:
[Parsing_Error: 4.] A [Person: woman] who is [Condition: pregnant], [Condition: nursing] an infant, or [Non-query-able: planning] a [Condition: pregnancy].